有關雙極性疾患（bipolar disorders）的敘述，下列何者錯誤？
A. 第一型雙極性疾患也可能有妄想症狀
B. 男女得病比率與重鬱症（major depressive disorder）相同
C. 第二型雙極性疾患須至少有一次輕躁發作與一次重鬱發作
D. 可能於青少年時期發作

正確答案：B. 男女得病比率與重鬱症（major depressive disorder）相同